Clinical trial inclusion criterion:
Asymptomatic women 45-68 years, residents in the Piedmont Region, attending the regional breast cancer screening program

Annotated entities:
- Qualifier: "Asymptomatic"
- Person: "women"
- Value: "45-68 years"
- Visit: "Piedmont Region"
- Procedure: "regional breast cancer screening program"